Use of any investigational or non-registered product (drug or vaccine) other than the study vaccine(s) within 30 days prior to the first vaccination, or planned use during the study period.

The above is a clinical trial exclusion criterion. Annotated with entity spans:
Use of any [Qualifier: investigational] or [Qualifier: non-registered] [Drug: product] ([Drug: drug] or [Drug: vaccine]) [Qualifier: other than the study vaccine(s)] [Temporal: within 30 days prior to the first vaccination], or [Mood: planned] [Procedure: use] [Temporal: during the study period].